¿Qué se estima con la medición de los pliegues cutáneos?
1. La masa corporal total.
2. La masa magra.
3. La grasa corporal.
4. La relación entre masa grasa y masa muscular.
5. La musculatura esquelética.

Respuesta correcta: 3. La grasa corporal.